Clinical trial exclusion criterion:
Women of child-bearing potential that do not practice adequate contraception.

Annotated entities:
- Person: "Women"
- Condition: "child-bearing potential"
- Negation: "do not"
- Procedure: "adequate contraception"